2. First-degree family history of any neurological disorder with a potentially hereditary basis, including migraines, epilepsy, or multiple sclerosis.

The above is a clinical trial exclusion criterion. Annotated with entity spans:
[Parsing_Error: 2.] [Qualifier: First-degree] [Observation: family history of] any [Condition: neurological disorder] with a [Qualifier: potentially hereditary basis], including [Condition: migraines], [Condition: epilepsy], or [Condition: multiple sclerosis].